下列有關根除性膀胱切除術（radical cystectomy）的敘述，何者錯誤？
A. 經膀胱內藥物灌注後仍反覆復發的high grade膀胱癌或膀胱原位癌（carcinoma in situ）患者，建議要施行此
B. 術前不必停止服用aspirin
C. 腿部深層靜脈血栓可能於術後發生
D. 手術的死亡率約為1～3%

正確答案：B. 術前不必停止服用aspirin